Clinical trial inclusion criterion:
Provide written, signed and dated informed consent prior to initiating any study-related activities.

Annotated entities:
- Informed_consent: "Provide written, signed and dated informed consent prior to initiating any study-related activities."